6歲的小明因為車禍頭部外傷，急救回來後即依賴呼吸器，在加護病房治療1週後，現在情況惡化，瞳孔放大且出現尿崩現象，血壓靠	升壓劑維持在100/54 mmHg左右，可能已經腦死，家屬仍處於極度悲傷的階段。你若身為加護病房醫師，下列何者處置不適當？
A. 照會神經科醫師進行腦死評估
B. 若血壓不穩定，醫師不能擅自停止升壓藥
C. 徵詢家屬器官捐贈之意願
D. 逕行移除呼吸器並轉出加護病房

正確答案：D. 逕行移除呼吸器並轉出加護病房